Clinical trial inclusion criteria:
Adult patients
Kidney transplant recipients
Patients treated by a calcineurin inhibitor and mycophenolic acid
Viremia >= 3 log UI/ml
Patients who have given written informed consent
Negative pregnancy test (blood ß-HCG dosage)

Annotated entities:
- Person: "Adult"
- Procedure: "Kidney transplant"
- Drug: "calcineurin inhibitor"
- Drug: "mycophenolic acid"
- Measurement: "Viremia"
- Value: ">= 3 log UI/ml"
- Informed_consent: "Patients who have given written informed consent"
- Measurement: "pregnancy test"
- Value: "Negative"
- Measurement: "blood ß-HCG dosage"